Which intoxication is associated with Burton's line?

Burton's line is characteristic for lead poisoning.